Clinical trial exclusion criterion:
HBsAg positive or HBcAb negative or hepatitis B virus DNA positive at baseline

Annotated entities:
- Condition: "HBsAg positive"
- Condition: "HBcAb negative"
- Condition: "hepatitis B virus DNA positive"
- Temporal: "at baseline"